甲狀腺毒性腺瘤（toxic adenoma）的手術治療選擇，下列何者最佳？
A. 患側單葉切除術
B. 患側次全切除術
C. 患側單葉切除及對側次全切除術
D. 雙側全切除術

正確答案：A. 患側單葉切除術